Clinical trial exclusion criterion:
No antiangiogenic concomitant treatment, 15 days before and 15 days after radioembolization, including Sorafenib

Annotated entities:
- Temporal: "15 days before radioembolization"
- Temporal: "15 days after radioembolization"
- Negation: "No"
- Procedure: "antiangiogenic treatment"
- Drug: "Sorafenib"